Previous myocardial revascularization surgery with = 1 internal mammary or radial artery graft;

The above is a clinical trial exclusion criterion. Annotated with entity spans:
[Temporal: Previous] [Procedure: myocardial revascularization surgery] with [Multiplier: = 1] [Device: internal mammary] or [Device: radial artery graft];